History of congesting heart failure with left ventricular ejection fraction <30% or exacerbation in the past 30 days.

The above is a clinical trial exclusion criterion. Annotated with entity spans:
History of [Condition: congesting heart failure] with [Measurement: left ventricular ejection fraction] [Value: <30%] or [Condition: exacerbation] [Temporal: in the past 30 days].